Clinical trial inclusion criterion:
ASA 1-3

Entity relations:
- Has_value("ASA", "1-3")